下列那種是恐慌症常用的心理防衛機轉？
A. 合理化作用（Rationalization）
B. 替代作用（Displacement）
C. 解離作用（Dissociation）
D. 壓抑作用（Suppression）

正確答案：B. 替代作用（Displacement）